Clinical trial inclusion criterion:
Overweight / obesity diagnostic criteria according to WHO-WPR

Entity relations:
- Has_qualifier("Overweight", "WHO-WPR")
- OR("Overweight", "obesity")